Clinical trial inclusion criteria:
Healthy patients age 18 and older
Breech presentation
Singleton gestation .scheduled for ECV desiring CSE.

Annotated entities:
- Condition: "Healthy"
- Person: "age"
- Value: "18 and older"
- Observation: "Breech presentation"
- Condition: "Singleton gestation"
- Procedure: "ECV"
- Procedure: "CSE"
- Mood: "desiring"
- Mood: "scheduled for"